有關焦慮反應之敘述，何者最不適切？
A. 與焦慮反應相關的三種最主要神經傳導物質為血清素、正腎上腺素、乙醯膽鹼
B. 適當的焦慮反應本身具有保護性及適應性
C. 當焦慮反應過強時會呈現交感神經興奮之相關症狀
D. 當焦慮反應造成日常生活功能、職業或社交功能損害時，需要就醫

正確答案：A. 與焦慮反應相關的三種最主要神經傳導物質為血清素、正腎上腺素、乙醯膽鹼